Clinical trial exclusion criterion:
medication: antidepressants or H1-receptor antagonists

Entity relations:
- OR("antidepressants", "H1-receptor antagonists")